Clinical trial inclusion criterion:
Creatinine clearance <60mL/min

Entity relations:
- Has_value("Creatinine clearance", "<60mL/min")